關於成人型脂漏性皮膚炎（seborrheic dermatitis）的敘述，下列何者錯誤？
A. 好發於四肢伸側
B. 病灶表面常伴有	屑
C. 感染人類免疫不全病毒（HIV）的患者，罹患此病之機率及嚴重度增加
D. 抗黴菌製劑ketoconazole對此病之治療有效

正確答案：A. 好發於四肢伸側